Clinical trial exclusion criterion:
Allergy to cis-UCA, or any constituents of the placebo emulsion cream or any constituents of Protopic® ointment

Annotated entities:
- Condition: "Allergy"
- Drug: "Protopic® ointment"
- Drug: "cis-UCA"
- Drug: "placebo emulsion cream"